¿Cuál de los siguientes grupos de fármacos utilizados en el tratamiento de la hiperplasia benigna de próstata ha demostrado una disminución del tamaño de la glándula, así como la disminución del riesgo de desarrollar una retención aguda de orina?
1. Inhibidores de la 5-alfa reductasa (5ARIs).
2. Inhibidores de la fosfodiesterasa E5 (PDE5).
3. Antagonistas de los receptores alfa adrenérgicos.
4. Antiangiogénicos.

Respuesta correcta: 1. Inhibidores de la 5-alfa reductasa (5ARIs).